Clinical trial inclusion criterion:
Patient either: refuses surgical treatment OR is contraindicated for surgical treatment

Entity relations:
- OR("refuses surgical treatment", "contraindicated for surgical treatment")